Subjects prescribed metformin or have taken metformin within 1 year.

The above is a clinical trial exclusion criterion. Annotated with entity spans:
Subjects prescribed [Drug: metformin] or have taken [Drug: metformin] [Temporal: within 1 year].